Hoehn and Yahr stage = 3

The above is a clinical trial inclusion criterion. Annotated with entity spans:
[Measurement: Hoehn and Yahr] [Value: stage = 3]